Clinical trial exclusion criterion:
Currently taking antidepressants or other psychiatric medications

Annotated entities:
- Drug: "antidepressants"
- Drug: "psychiatric medications"